Clinical trial exclusion criteria:
Pregnancy or breastfeeding
Allergy against to penicillin or cephalosporins
Renal impairment
Active hepatic disease
Antibiotic use except study drugs
Immunosuppressive therapy before 6 months of study initiation
Use of probenecid like drugs

Annotated entities:
- Condition: "Pregnancy"
- Observation: "breastfeeding"
- Condition: "Allergy"
- Drug: "penicillin"
- Drug: "cephalosporins"
- Condition: "Renal impairment"
- Condition: "hepatic disease"
- Qualifier: "Active"
- Drug: "Antibiotic"
- Negation: "except"
- Drug: "study drugs"
- Procedure: "Immunosuppressive therapy"
- Temporal: "before 6 months of study initiation"
- Reference_point: "study initiation"
- Drug: "probenecid like drugs"
- Drug: "probenecid"
- Qualifier: "probenecid like"